Clinical trial inclusion criterion:
Written informed consent signed by the participant

Annotated entities:
- Informed_consent: "Written informed consent signed by the participant"